下列有關瘧疾的敘述，何者正確？
A. 西非的黑人及其後裔，血型多為 Duffy 陰性，不會感染間日瘧
B. 卵形瘧原蟲的滋養體在血液抹片上之鑑定特徵，是看其是否有帶狀型滋養體（band form trophozoites）
C. 三日瘧原蟲較喜侵入網織紅血球（reticulocytes）中分裂增殖
D. 全球各地的惡性瘧都已出現 chloroquine-resistance

正確答案：A. 西非的黑人及其後裔，血型多為 Duffy 陰性，不會感染間日瘧